下列何種分枝桿菌（Mycobacteria）屬於慢速生長型（slow-growing）？
A. 龜分枝桿菌（Mycobacterium chelonae）
B. 結核分枝桿菌（Mycobacterium tuberculosis）
C. 偶發分枝桿菌（Mycobacterium fortuitum）
D. 膿瘍分枝桿菌（Mycobacterium abscessus）

正確答案：B. 結核分枝桿菌（Mycobacterium tuberculosis）